Clinical trial exclusion criterion:
History of clinically significant hypersensitivity or allergic drug reactions

Entity relations:
- Has_qualifier("hypersensitivity", "clinically significant")
- AND("allergic drug reactions", "clinically significant")
- OR("hypersensitivity", "allergic drug reactions")